Clinical trial inclusion criterion:
Able to complete precision grips with both hands

Entity relations:
- Has_mood("complete precision grips with both hands", "Able to")